Clinical trial exclusion criterion:
Diagnosis of any other neurologic disease

Entity relations:
- Has_qualifier("neurologic disease", "any other")